¿Para qué trastorno de la infancia se considera que la terapia combinada (tratamiento farmacológico más psicológico) es la alternativa más eficaz?:
1. El trastorno por déficit de atención con hiperactividad.
2. La depresión subclínica.
3. La enuresis.
4. La encopresis.
5. El trastorno de ansiedad por separación.

Respuesta correcta: 1. El trastorno por déficit de atención con hiperactividad.